Untreated, severe, left sided valvular heart disease including mitral regurgitation or stenosis, and aortic regurgitation or stenosis.

The above is a clinical trial exclusion criterion. Annotated with entity spans:
[Qualifier: Untreated], [Qualifier: severe], [Qualifier: left sided] [Condition: valvular heart disease] including [Condition: mitral regurgitation] or stenosis, and [Condition: aortic regurgitation] or stenosis.